特異性顆粒（specific granule）中具有類晶體（crystalloid body）的白血球是什麼？
A. 單核球
B. 嗜酸性球
C. 嗜鹼性球
D. 嗜中性球

正確答案：B. 嗜酸性球